Clinical trial inclusion criteria:
Patients with chronic heart failure of New York Heart Association Class II or III, a left ventricular ejection fraction of = 40% for patients in NYHA class II or = 45% for patients in NYHA class III, a hemoglobin level at the screening visit between 9.5-13.5 g/dl, and iron deficiency, which is defined as serum ferritin level < 100µg/l or between 100 and 299 µg/l, when transferring saturation is < 20%.
Age =18 years
Obtained informed consent
Stable pharmacological therapy during the last 4 weeks (with the exception of diuretics)

Annotated entities:
- Condition: "chronic heart failure"
- Measurement: "New York Heart Association"
- Value: "Class II or III"
- Measurement: "left ventricular ejection fraction"
- Value: "= 40%"
- Measurement: "NYHA"
- Value: "class II"
- Measurement: "NYHA"
- Value: "class III"
- Value: "= 45%"
- Measurement: "hemoglobin level"
- Temporal: "at the screening visit"
- Reference_point: "the screening visit"
- Value: "between 9.5-13.5 g/dl"
- Condition: "iron deficiency"
- Measurement: "serum ferritin level"
- Value: "< 100µg/l"
- Value: "between 100 and 299 µg/l"
- Measurement: "transferring saturation"
- Value: "< 20%"
- Person: "Age"
- Value: "=18 years"
- Post-eligibility: "Obtained informed consent"
- Procedure: "pharmacological therapy"
- Qualifier: "Stable"
- Temporal: "during the last 4 weeks"
- Reference_point: "last 4 weeks"
- Drug: "diuretics"
- Negation: "with the exception of"